Clinical trial exclusion criterion:
pain or other disorders precluding their participation.

Entity relations:
- Has_qualifier("pain", "precluding their participation")
- OR("pain", "other disorders")